精子（spermatozoa）形成後未射精前貯存於：
A. 曲細精管（seminiferous tubules）
B. 貯精囊（seminal vesicle）
C. 副睪（epididymis）
D. 尿道球腺體（bulbourethral gland）

正確答案：C. 副睪（epididymis）